Clinical trial exclusion criterion:
10. Single vessel (single territory) disease.

Annotated entities:
- Condition: "Single vessel disease"
- Condition: "single territory disease"